Clinical trial exclusion criterion:
Participating in another clinical trial.

Annotated entities:
- Non-query-able: "Participating in another clinical trial"